En 1984 se inicia en España el proceso de reforma de la asistencia sanitaria con la publicación de:
1. La Ley General de Sanidad.
2. La Ley General de la Seguridad Social.
3. La Ley de Cohesión y Calidad del Sistema Nacional de Salud.
4. El Real Decreto de Estructuras Básicas de Salud.
5. El Real Decreto de Salud Nacional.

Respuesta correcta: 4. El Real Decreto de Estructuras Básicas de Salud.